Clinical trial exclusion criterion:
Pregnancy or lactation

Annotated entities:
- Pregnancy_considerations: "Pregnancy or lactation"